在台灣，家族性血栓好發症（thrombophilia）最常見的原因為：
A. Protein C deficiency
B. Protein S deficiency
C. Antithrombin III deficiency
D. Activated protein C resistance

正確答案：B. Protein S deficiency